Centor criteria are used for which disease?

Centor criteria were developed to diagnose streptococcal pharyngitis.